Clinical trial exclusion criterion:
History of treatment for molar pregnancy like prior evacuation or chemotherapy

Annotated entities:
- Condition: "molar pregnancy"
- Procedure: "treatment"
- Procedure: "evacuation"
- Procedure: "chemotherapy"